22歲男性患者因為胃腸息肉接受檢查，發現在嘴唇有許多黑色pigmentation，其最可能的診斷為何？
A. Osler-Weber-Rendu syndrome
B. Peutz-Jeghers syndrome
C. familial adenomatous polyposis
D. Turcot's syndrome

正確答案：B. Peutz-Jeghers syndrome